藥物清除率與下列何因子無關？
A. Volume of distribution(Vd)
B. Albumin concentration
C. Capacity-limited protein binding
D. Alpha1-acid glycoprotein concentration

正確答案：A. Volume of distribution(Vd)